Mutation of which gene is associated with Achondroplasia?

Achondroplasia is due to mutations in the fibroblast growth factor receptor 3 (FGFR3) gene.